Clinical trial exclusion criterion:
Any confirmed or suspected immunosuppressive or immunodeficient condition, including HIV infection;

Entity relations:
- Subsumes("immunosuppressive condition", "HIV infection")
- OR("immunosuppressive condition", "immunodeficient condition")